Clinical trial exclusion criterion:
Non-compliance with DOTPlus. Alternatively DOT can be done by telephoning patient on a daily basis 5 times a week and having patient annotate taking drug in a log which would be reviewed by clinic staff

Entity relations:
- AND("Non-compliance", "DOTPlus")